Clinical trial exclusion criterion:
previous lower abdominal surgery with an abnormal micturition

Annotated entities:
- Procedure: "lower abdominal surgery"
- Condition: "micturition"
- Qualifier: "abnormal"